History of treatment for molar pregnancy like prior evacuation or chemotherapy

The above is a clinical trial exclusion criterion. Annotated with entity spans:
History of [Procedure: treatment] for [Condition: molar pregnancy] like prior [Procedure: evacuation] or [Procedure: chemotherapy]